內斜視眼在做交替遮蓋測	（alternate cover test）時，遮蓋物由右眼移至左眼時，右眼會呈現何種移動？
A. 內展（adduction）
B. 外展（abduction）
C. 向下（downword movement）
D. 向上（upward movement）

正確答案：B. 外展（abduction）